干擾素能阻礙微生物在細胞內繁殖。下列何者歸類於第二類干擾素？
A. IL-6
B. IFN-α
C. IFN-β
D. IFN-γ

正確答案：D. IFN-γ